Clinical trial exclusion criterion:
Blood donation of more than 450ml in the previous three months.

Annotated entities:
- Procedure: "Blood donation"
- Qualifier: "of more than 450ml"
- Value: "more than 450ml"
- Temporal: "in the previous three months"